Prior coronary revascularization (PCI or CABG) or myocardial infarction (as evidenced by previously elevated CPK-MB or troponin levels)

The above is a clinical trial exclusion criterion. Annotated with entity spans:
[Temporal: Prior] [Condition: coronary revascularization] ([Procedure: PCI] or [Procedure: CABG]) or [Condition: myocardial infarction] (as evidenced by [Temporal: previously] [Value: elevated] [Measurement: CPK-MB] or [Measurement: troponin levels])